Clinical trial exclusion criterion:
Pregnant women

Entity relations:
- AND("women", "Pregnant")